Preoperative recent history of opioid or alcohol abuse

The above is a clinical trial exclusion criterion. Annotated with entity spans:
[Temporal: Preoperative] [Temporal: recent] [Temporal: history] of [Condition: opioid] or [Condition: alcohol abuse]